Clinical trial inclusion criteria:
Patients with de novo stenotic lesions who are suitable for coronary stenting with drug-eluting stent

Annotated entities:
- Qualifier: "de novo"
- Condition: "stenotic lesions"
- Mood: "suitable"
- Procedure: "coronary stenting"
- Device: "drug-eluting stent"